Which company produces the Oncomine Dx target test?

The Oncomine Dx Target Test Panel is produced by Thermo Fisher Scientific.